Clinical trial inclusion criterion:
type 1 and 2 diabetic patients

Entity relations:
- Has_qualifier("diabetic", "type 1")
- OR("type 1", "type 2")